Clinical trial exclusion criterion:
Evidence of severe or uncontrolled systemic diseases, including active bleeding diatheses or active infections including hepatitis B, C and Human Immunodeficiency Virus (HIV)

Annotated entities:
- Qualifier: "uncontrolled"
- Condition: "systemic diseases"
- Qualifier: "severe"
- Condition: "active bleeding diatheses"
- Condition: "active infections"
- Condition: "hepatitis B"
- Condition: "Human Immunodeficiency Virus (HIV)"
- Condition: "hepatitis C"